De acuerdo con el modelo de los Cinco Grandes ¿En qué dimensión puntuaría alto una mujer imaginativa, creativa, interesada por las ideas y experiencias nuevas?:
1. Actividad.
2. Apertura.
3. Extraversión.
4. Búsqueda de Sensaciones Impulsiva.

Respuesta correcta: 2. Apertura.